Clinical trial exclusion criterion:
Serum creatinine > 1.5 mg/dL

Annotated entities:
- Measurement: "Serum creatinine"
- Value: "> 1.5 mg/dL"